Clinical trial exclusion criterion:
Disease which affect efficacy and safety of drugs

Annotated entities:
- Drug: "Disease"
- Qualifier: "affect efficacy"
- Qualifier: "safety of drugs"